Clinical trial exclusion criterion:
Recent CVA clinically confirmed (by neurologist) or neuroimaging confirmed stroke or transient ischemic attack (TIA) within 6 months (180 days) of the procedure.

Entity relations:
- Has_value("neuroimaging", "confirmed")
- AND("stroke", "neuroimaging")
- Has_qualifier("CVA", "clinically confirmed (by neurologist)")
- Has_index("within 6 months (180 days) of the procedure", "the procedure")
- OR("stroke", "transient ischemic attack (TIA)")
- OR("CVA", "stroke")